Los temblores que se producen en la enfermedad de Parkinson son:
1. Posturales.
2. Intencionales.
3. Coreiformes.
4. De reposo.

Respuesta correcta: 4. De reposo.